Clinical trial inclusion criterion:
Performance status 0-2 (Appendix B) may include patients with performance status > 2 attributable to LAL.

Annotated entities:
- Measurement: "Performance status"
- Value: "0-2"
- Non-representable: "(Appendix B) may include patients with performance status > 2 attributable to LAL"